patients with previous surgery of the cervix (conization);

The above is a clinical trial exclusion criterion. Annotated with entity spans:
patients with previous [Procedure: surgery] of the [Qualifier: cervix] ([Procedure: conization]);